懷孕前期常需補充葉酸（folic acid），下列有關葉酸的敘述，何者錯誤？
A. 葉酸參與核苷酸deoxythymidine 5'-monophosphate（dTMP）的合成
B. 葉酸為構成輔酶A（coenzyme A）的基本元素之一
C. 四氫葉酸（H4 folate）為一種具有生物活性的葉酸型式
D. 四氫葉酸（H4 folate）是由6-methylpterin、p-aminobenzoate與glutamate所組成

正確答案：B. 葉酸為構成輔酶A（coenzyme A）的基本元素之一